有關侷限性心包炎（constrictive pericarditis）的敘述，何者不正確？
A. 腹水發生
B. 下肢水腫
C. 出現肺水腫
D. 肋膜腔積水

正確答案：C. 出現肺水腫